一位 60 歲男性因消化性潰瘍出血接受過胃部分切除手術（Billroth II procedure）後發生飯後腹痛、脹氣、腹瀉合併脂肪和維生素B12的吸收不良情形，治療上下列何項藥物最適當？
A. 質子幫浦抑制劑（proton pump inhibitor）
B. 抗生素（antibiotics）
C. 胃腸蠕動促進劑（prokinetics）
D. 制酸劑（antacid）

正確答案：B. 抗生素（antibiotics）